Clinical trial inclusion criterion:
Established (i.e. by clinical signs or imaging studies) coronary artery disease (CAD) Established (i.e. by clinical signs or imaging studies) peripheral vascular disease (PVD) Previous stroke Previous MI Diabetes mellitus with target organ disease OR

Annotated entities:
- Condition: "coronary artery disease (CAD)"
- Condition: "peripheral vascular disease (PVD)"
- Condition: "stroke"
- Temporal: "Previous"
- Observation: "Established"
- Observation: "clinical signs"
- Procedure: "imaging studies"
- Condition: "MI"
- Condition: "Diabetes mellitus"
- Condition: "target organ disease"
- Parsing_Error: "OR"
- Temporal: "Previous"
- Observation: "Established"
- Observation: "clinical signs"
- Procedure: "imaging studies"